Not appropriate for oral antidiabetic agent

The above is a clinical trial exclusion criterion. Annotated with entity spans:
[Negation: Not] [Observation: appropriate] for [Drug: oral antidiabetic agent]